Non-reversible airway obstruction (post-bronchodilator FEV1/FVC < 0.7 and FEV1 < 80 %)

The above is a clinical trial inclusion criterion. Annotated with entity spans:
[Qualifier: Non-reversible] [Condition: airway obstruction] ([Qualifier: post-bronchodilator] [Measurement: FEV1/FVC] [Value: < 0.7] and [Measurement: FEV1] [Value: < 80 %])